La Historia de la Enfermería se narra alrededor de las relaciones entre los diferentes elementos y los factores que delimitan períodos o fases estables de la historia, denominadas:
1. Doméstica; Preprofesional; Religiosa y Postprofesional.
2. Tribal/Doméstica; Religiosa/ Institucional; Preprofesional y Profesional.
3. Tribal; Religiosa; Doméstica e Institucional.
4. Tribal/Doméstica;         Antigua/Relacional; Científica/Profesional y Postprofesional.
5. Empírica; Vocacional y Científica.

Respuesta correcta: 2. Tribal/Doméstica; Religiosa/ Institucional; Preprofesional y Profesional.